¿Cuál de los siguientes pares craneales tiene el recorrido de mayor longitud a través de un conducto óseo?
1. El trigémino.
2. El patético o troclear.
3. El óptico.
4. El facial.
5. El olfatorio.

Respuesta correcta: 4. El facial.